一位 48 歲男性病人，主訴行動緩慢及非常容易昏倒，患者行動遲緩，使用 L-DOPA 治療已有數年，但效果不明顯；於理學檢查時發現：右手臂血壓（收縮壓/舒張壓）於平躺時為 130 mmHg/80 mmHg ，坐起時血壓為 90 mmHg/50 mmHg，此時臉色極度蒼白；測量左手臂之血壓，平躺時為 120 mmHg/90 mmHg，坐起時為 80 mmHg/50 mmHg。這患者最可能的診斷為：
A. Wilson's disease
B. Huntington's disease
C. Shy-Drager syndrome
D. Guillain-Barré syndrome

正確答案：C. Shy-Drager syndrome